三叉神經（trigeminal nerve）之分支接受：
A. 第七顱神經所發出之副交感神經纖維伴行，控制瞳孔括約肌（sphincter pupillae）
B. 舌咽神經（glossopharyngeal nerve）所發出之副交感神經纖維伴行，控制耳下腺（parotid gland）
C. 第三顱神經所發出之副交感神經纖維伴行，控制淚腺（lacrimal gland）
D. 舌下神經（hypoglossal nerve）所發出之副交感神經纖維伴行，控制舌下腺（sublingual gland）

正確答案：B. 舌咽神經（glossopharyngeal nerve）所發出之副交感神經纖維伴行，控制耳下腺（parotid gland）